Clinical trial exclusion criterion:
apnea hypopnea index > 5 events per hour

Entity relations:
- Has_value("apnea hypopnea index", "> 5 events per hour")